Clinical trial exclusion criterion:
2. Subject has a severe medical or psychiatric illness that, in the opinion of the Investigator, would affect subject safety or compliance

Annotated entities:
- Condition: "psychiatric illness"
- Condition: "medical illness"
- Qualifier: "severe"
- Undefined_semantics: "severe"
- Qualifier: "in the opinion of the Investigator, would affect subject safety or compliance"
- Non-query-able: "in the opinion of the Investigator, would affect subject safety or compliance"